下列何者為提睪肌（cremaster muscle）的主要支配神經？
A. 股神經
B. 陰部神經
C. 生殖股神經
D. 髂腹股溝神經

正確答案：C. 生殖股神經